一個正常孩童可以不扶東⻄單腳站立10秒、能照樣式畫圓圈、能表達「你的」「我的」，其發展年齡最接近下列何者範圍？
A. 滿2歲但未滿3歲
B. 滿3歲但未滿4歲
C. 滿4歲但未滿5歲
D. 滿5歲但未滿6歲

正確答案：B. 滿3歲但未滿4歲